Other serious underlying medical conditions which could impair the ability of the patient to participate in the study

The above is a clinical trial exclusion criterion. Annotated with entity spans:
Other [Condition: serious] underlying medical conditions which could impair the [Observation: ability of the patient to participate] in the study